Clinical trial exclusion criterion:
Causes of PH other than that of heart failure, such as: chronic thromboembolic PH, sickle-cell disease, or sarcoidosis

Entity relations:
- Has_negation("heart failure", "other than")
- AND("Causes of PH", "heart failure")
- AND("heart failure", "chronic thromboembolic PH")
- OR("chronic thromboembolic PH", "sickle-cell disease", "sarcoidosis")